Subject with a history of a positive test for Hepatitis B surface antigen (HbsAg) or Hepatitis C

The above is a clinical trial exclusion criterion. Annotated with entity spans:
Subject with a [Temporal: history of] a [Value: positive] [Measurement: test for Hepatitis B surface antigen (HbsAg)] or Hepatitis C